Clinical trial exclusion criterion:
presence of pulp exposure in the selected tooth

Entity relations:
- Has_qualifier("pulp exposure", "selected tooth")